Clinical trial exclusion criterion:
prior allergic reaction to interferon products, congestive heart failure, elevated liver enzymes

Annotated entities:
- Temporal: "prior"
- Condition: "allergic reaction"
- Drug: "interferon products"
- Condition: "congestive heart failure"
- Condition: "elevated liver enzymes"